Clinical trial inclusion criterion:
T2DM as defined by American Diabetes Association (ADA) criteria

Annotated entities:
- Condition: "T2DM"
- Qualifier: "American Diabetes Association (ADA) criteria"